History of renal calculi

The above is a clinical trial exclusion criterion. Annotated with entity spans:
[Temporal: History] of [Condition: renal calculi]